Clinical trial inclusion criterion:
interferon ß-1a,

Annotated entities:
- Drug: "interferon ß-1a"